history of steroid cortisol administration

The above is a clinical trial exclusion criterion. Annotated with entity spans:
history of [Drug: steroid cortisol] administration